Clinical trial exclusion criterion:
Immunization with any other vaccine (oral or parenteral) within 4 weeks prior to study start or planned vaccination during the study

Annotated entities:
- Procedure: "Immunization with vaccine"
- Qualifier: "any other"
- Qualifier: "oral"
- Qualifier: "parenteral"
- Temporal: "within 4 weeks prior to study start"
- Reference_point: "study start"
- Mood: "planned"
- Procedure: "vaccination"
- Temporal: "during the study"
- Reference_point: "the study"